Clinical trial exclusion criterion:
E.coli isolate resistant to pivmecillinam

Annotated entities:
- Drug: "pivmecillinam"
- Condition: "E.coli isolate"
- Qualifier: "resistant to pivmecillinam"